Clinical trial exclusion criterion:
Poor compliance or refusal to participate.

Entity relations:
- OR("Poor compliance", "refusal to participate")